Clinical trial inclusion criterion:
Serum haemoglobin of 9.5 to 14.0 g/dL

Annotated entities:
- Measurement: "Serum haemoglobin"
- Value: "9.5 to 14.0 g/dL"